History of renal insufficiency or failure

The above is a clinical trial exclusion criterion. Annotated with entity spans:
History of [Condition: renal insufficiency] or failure